¿Qué prueba del WISC-IV pertenece al índice de velocidad de procesamiento:
1. Dígitos.
2. Claves.
3. Figuras incompletas.
4. Letras y números.

Respuesta correcta: 2. Claves.